Clinical trial exclusion criterion:
Patients with liver cirrhosis, Hepatocellular Carcinoma or AFP >2 ULN or other malignancies.

Annotated entities:
- Condition: "liver cirrhosis"
- Condition: "Hepatocellular Carcinoma"
- Measurement: "AFP"
- Value: ">2 ULN"
- Condition: "malignancies"